What gene is mutated in Huntington's Disease patients?

Huntington's disease (HD; OMIM 143100), a progressive neurodegenerative disorder, is caused by an expanded trinucleotide CAG (polyQ) motif in the huntingtin gene.